Clinical trial exclusion criterion:
previous retinal vein occlusion.

Entity relations:
- Has_temporal("retinal vein occlusion", "previous")